Subject refusing to sign the consent form

The above is a clinical trial exclusion criterion. Annotated with entity spans:
[Post-eligibility: Subject refusing to sign the consent form]